Postmenopausal women

The above is a clinical trial inclusion criterion. Annotated with entity spans:
[Condition: Postmenopausal] [Person: women]